Clinical trial exclusion criterion:
current use of smokeless tobacco, tobacco cigarettes (5 and fewer a day)

Annotated entities:
- Procedure: "smokeless tobacco"
- Procedure: "tobacco cigarettes"
- Multiplier: "5 and fewer a day"